Clinical trial exclusion criterion:
Any phosphodiesterase 5 inhibitor (sildenafil, tadalafil, avanafil, vardenafil) has been taken within 72 hours prior to the study.

Entity relations:
- Subsumes("phosphodiesterase 5 inhibitor", "sildenafil")
- Has_index("within 72 hours prior to the study", "study")
- Has_temporal("phosphodiesterase 5 inhibitor", "within 72 hours prior to the study")
- OR("sildenafil", "tadalafil", "avanafil", "vardenafil")